在原發性膜性腎病變（primary membranous nephropathy）沉積在腎小球最主要的免疫球蛋白為：
A. IgG1
B. IgG2
C. IgG3
D. IgG4

正確答案：D. IgG4